Clinical trial exclusion criterion:
Tourette syndrome

Annotated entities:
- Condition: "Tourette syndrome"